55歲男性，一個月來食慾不振，體重減少6公斤，家人發現其小便顏色變成茶色，帶來醫院檢查，抽血發現total bilirubin level 為7.8 mg/dL， direct form bilirubin level為6.9 mg/dL，腫瘤指數也升高，下列何者最不可能為病因？
A. 膽管癌
B. 胰臟癌
C. 空腸癌
D. 壺腹癌

正確答案：C. 空腸癌